Clinical trial inclusion criteria:
age=65 years
diagnosis with mantle cell lymphoma
Ann Arbor stage II,III or IV
ECOG=1 or if ECOG=2 but recover after pretreatment.

Annotated entities:
- Person: "age"
- Value: "=65 years"
- Condition: "mantle cell lymphoma"
- Measurement: "Ann Arbor stage"
- Value: "II"
- Value: "III"
- Value: "IV"
- Measurement: "ECOG"
- Value: "=1"
- Measurement: "ECOG"
- Value: "=2"
- Temporal: "after pretreatment"
- Reference_point: "pretreatment"
- Condition: "recover"
- Procedure: "pretreatment"